Clinical trial exclusion criterion:
Age < 20 or > 35 years.

Annotated entities:
- Person: "Age"
- Value: "< 20"
- Value: "> 35 years"